Diagnostic and Statistical Manual of Mental Disorders, 4th Edition (DSM IV) test positive for dementia

The above is a clinical trial inclusion criterion. Annotated with entity spans:
[Measurement: Diagnostic and Statistical Manual of Mental Disorders, 4th Edition (DSM IV) test] [Value: positive] for dementia